Clinical trial exclusion criterion:
Subject has any significant congenital heart defect corrected or not (except for patent foramen ovale that is allowed).

Annotated entities:
- Condition: "congenital heart defect"
- Qualifier: "significant"
- Negation: "except"
- Condition: "patent foramen ovale"